informed consent

The above is a clinical trial inclusion criterion. Annotated with entity spans:
[Non-query-able: informed consent]